下列有關低血鉀的治療敘述，何者錯誤？
A. 腎小管酸血症引起的低血鉀補充 potassium citrate 優於 potassium chloride
B. 週邊靜脈輸注 potassium chloride 時，注射速度每小時不應超過 20 mmol
C. potassium chloride 可加在 normal saline 或 dextrose solution，輸注後升鉀的效果一樣
D. 中心靜脈補充鉀離子時，potassium chloride 注射液濃度可至 60 mmol/L

正確答案：C. potassium chloride 可加在 normal saline 或 dextrose solution，輸注後升鉀的效果一樣